Clinical trial exclusion criteria:
BMI <35 and > 60 kg/m2
Inability to walk (bed-bound or wheelchair dependence)
open abdominal surgeries except simple appendectomy and common OB/GYN procedures in the pelvis (hysterectomy, C-section, and oophorectomy, tubal ligation)
laparoscopic bowel or solid organ resection except laparoscopic cholecystectomy
ventral hernia repair with mesh
Preoperative chronic opiate use for chronic pain defined as opiate usage at least 60 mg/day of morphine equivalent for = 3 months (as defined by International Association for the Study of Pain22) in the one year period prior to the bariatric surgery
The American Society of Anesthesiologists (ASA) score > 3
History of hypersensitivity or adverse reaction to bupivacaine or narcotics
Inability to speak English
ventral hernia repair
Cholecystectomy
hiatal hernia repair with posterior cruroplasty
extensive lysis of adhesions
other procedures that mandate addition of "trocar(s)" or "feeding tube"
Addition of trocar(s) or conversion of surgery to hand-assisted or open

Annotated entities:
- Measurement: "BMI"
- Value: "<35 and > 60 kg/m2"
- Condition: "Inability to walk"
- Condition: "wheelchair dependence"
- Condition: "bed-bound"
- Procedure: "open abdominal surgeries"
- Procedure: "simple appendectomy"
- Procedure: "common OB/GYN procedures"
- Qualifier: "pelvis"
- Procedure: "hysterectomy"
- Procedure: "C-section"
- Procedure: "oophorectomy"
- Procedure: "tubal ligation"
- Negation: "except"
- Procedure: "laparoscopic bowel resection"
- Procedure: "solid organ resection"
- Procedure: "laparoscopic cholecystectomy"
- Negation: "except"
- Condition: "ventral hernia"
- Procedure: "repair with mesh"
- Temporal: "Preoperative"
- Condition: "chronic pain"
- Drug: "opiate"
- Multiplier: "chronic"
- Drug: "opiate"
- Multiplier: "at least 60 mg/day of morphine equivalent"
- Multiplier: "for = 3 months"
- Temporal: "in the one year period prior to the bariatric surgery"
- Reference_point: "the bariatric surgery"
- Procedure: "bariatric surgery"
- Measurement: "American Society of Anesthesiologists (ASA) score"
- Value: "> 3"
- Condition: "hypersensitivity"
- Condition: "adverse reaction"
- Drug: "bupivacaine"
- Drug: "narcotics"
- Non-query-able: "Inability to speak English"
- Condition: "ventral hernia"
- Procedure: "repair"
- Procedure: "Cholecystectomy"
- Condition: "hiatal hernia"
- Procedure: "repair"
- Procedure: "posterior cruroplasty"
- Condition: "lysis of adhesions"
- Qualifier: "extensive"
- Non-representable: "other procedures that mandate addition of "trocar(s)" or "feeding tube""
- Drug: "trocar"
- Observation: "conversion of surgery"
- Procedure: "hand-assisted"
- Procedure: "open"
- Procedure: "surgery"
- Mood: "Addition of"